Clinical trial inclusion criterion:
Planned primary percutaneous coronary intervention

Annotated entities:
- Mood: "Planned"
- Procedure: "primary percutaneous coronary intervention"